下列何者不會促進胃相期（gastric phase）之胃酸分泌？
A. 胃壁受到食物擴張
B. 蛋白質消化後之產物
C. 胰泌素（secretin）分泌增加
D. 刺激迷走神經

正確答案：C. 胰泌素（secretin）分泌增加